Clinical trial exclusion criterion:
History of receiving any antibiotics within prior 3 months,

Annotated entities:
- Drug: "antibiotics"
- Temporal: "within prior 3 months"
- Temporal: "History"